Clinical trial exclusion criterion:
life expectancy less than 2 years;

Annotated entities:
- Observation: "life expectancy"
- Value: "less than 2 years"